What in vivo tau tracers are being used?

in-vivo tau PET imaging ligands include [(18)F]THK523, [(18)F]THK5117, [(18)F]THK5105 and [(18)F]THK5351, [(18)F]AV1451(T807) [(11)C]PBB3, (18)F-THK5117, [(18)F]T808, 18F-RO6958948.